• Family history of SpA (presence of ankylosing spondylitis, psoriasis, acute uveitis, reactive arthritis, or IBD)

The above is a clinical trial inclusion criterion. Annotated with entity spans:
• [Observation: Family history] of [Condition: SpA] (presence of [Condition: ankylosing spondylitis], [Condition: psoriasis], [Condition: acute uveitis], [Condition: reactive arthritis], or [Condition: IBD])